Clinical trial exclusion criterion:
known arthritis.

Annotated entities:
- Condition: "arthritis"